7. History of subarachnoid hemorrhage

The above is a clinical trial exclusion criterion. Annotated with entity spans:
7. [Temporal: History] of [Condition: subarachnoid hemorrhage]